Clinical trial exclusion criterion:
History of hypersensitivity to ARBs or dihydropyridines

Annotated entities:
- Condition: "hypersensitivity"
- Drug: "ARBs"
- Drug: "dihydropyridines"
- Temporal: "History of"